3. Agree to participant in the trial.

The above is a clinical trial inclusion criterion. Annotated with entity spans:
3. [Post-eligibility: Agree to participant in the trial.]